3歲女童發燒2天、喉嚨痛、流口水、胃口不佳，口腔前部無異常、後咽壁有潰瘍，且合併有手掌腳掌皮疹。最可能的診斷是：
A. 疱疹性齒齦口腔炎（Herpetic gingivostomatitis）
B. 手足口症（Hand-foot-and-mouth disease）
C. 德國麻疹（Rubella）
D. 水痘（Chickenpox）

正確答案：B. 手足口症（Hand-foot-and-mouth disease）